Administration of HES, dextrane solutions or > 500 ml of Gelatin solutions within the 24 h prior to randomization

The above is a clinical trial exclusion criterion. Annotated with entity spans:
Administration of [Drug: HES], [Drug: dextrane solutions] or [Multiplier: > 500 ml] of [Drug: Gelatin solutions] [Temporal: within the 24 h prior to randomization]